Subjects legal or mentally disabled to give an informed consent for participating on this study

The above is a clinical trial exclusion criterion. Annotated with entity spans:
[Informed_consent: Subjects legal or mentally disabled to give an informed consent for participating on this study]